Clinical trial exclusion criterion:
Hemochromatosis

Annotated entities:
- Condition: "Hemochromatosis"